Clinical trial exclusion criterion:
Investigator discretion

Annotated entities:
- Non-query-able: "Investigator discretion"